Clinical trial inclusion criterion:
Be at least 18 years of age and able to give informed consent.

Annotated entities:
- Value: "at least 18 years"
- Person: "age"
- Non-query-able: "able to give informed consent"
- Post-eligibility: "able to give informed consent"